Informed consent obtained with information sheet given and explained and the consent form signed by the participant of the project investigator at the latest the day of the inclusion

The above is a clinical trial inclusion criterion. Annotated with entity spans:
[Informed_consent: Informed consent obtained with information sheet given and explained and the consent form signed by the participant of the project investigator at the latest the day of the inclusio]n